El receptor del linfocito T (TCR):
1. Experimenta cambio de clase.
2. No experimenta maduración de la afinidad.
3. Transmite señales al linfocito T por sí solo.
4. Tiene dos sitios de reconocimiento antigénico como los anticuerpos.
5. Realiza funciones efectoras mediadas por sus regiones constantes.

Respuesta correcta: 2. No experimenta maduración de la afinidad.